下列有關人類免疫不全病毒（簡稱 HIV）感染的診斷之敘述，何者正確？
A. 與愛滋病患共同針頭的靜脈藥物毒癮者接受 HIV-1/HIV-2 ELISA 篩檢，結果呈陰性，即可排除 HIV 感染之診斷
B. 原本健康捐血者，篩檢 HIV-1/HIV-2 ELISA 結果呈陽性，應診斷 HIV 感染，並在 7 天內進行法定傳染病通報
C. 原本健康同性戀接受 HIV-1/HIV-2 ELISA 篩檢，結果呈陽性，且 HIV-1 西方墨點法（Western blot）也呈陽性，應診斷 HIV 感染，並在 7 天內進行法定傳染病通報
D. 20 歲男性罹患隱球菌腦膜炎（cryptococcal meningitis），HIV-1 ELISA 呈陽性，HIV-1 西方墨點法也呈陽性，應診斷愛滋病，並在 24 小時內進行法定傳染病通報

正確答案：D. 20 歲男性罹患隱球菌腦膜炎（cryptococcal meningitis），HIV-1 ELISA 呈陽性，HIV-1 西方墨點法也呈陽性，應診斷愛滋病，並在 24 小時內進行法定傳染病通報